What is caused by heterozygous lamin B1 and lamin B2 variants?

Heterozygous lamin B1 and Lamin B2 variants cause primary microcephaly and define a novel laminopathy